一個無先天異常或後天重大肺感染疾病的患者，接受肺葉切除手術後，其術後肺功能將受到一定程度的損傷，在無特殊其他肺疾病的情形下，下列那個肺葉切除後對其術後肺功能的影響最小？
A. 右肺上葉
B. 右肺中葉
C. 左肺上葉
D. 左肺下葉

正確答案：B. 右肺中葉